視網膜神經節細胞投射至下列何處，其功能與控制眼球運動相關？
A. 上丘（superior colliculus）
B. 四疊體前核（pretectal nucleus）
C. 視交叉上核（suprachiasmatic nucleus）
D. 丘腦枕部（pulvinar）

正確答案：A. 上丘（superior colliculus）